Inability to provide informed consent

The above is a clinical trial exclusion criterion. Annotated with entity spans:
[Informed_consent: Inability to provide informed consent]